一位 6 歲男孩因為在學校上課時常發呆，以致學習欠佳功課差而來看診。身體檢查（physical examination）無特殊發現，但在檢查時突然發呆，兩眼直視無神，身體停止動作，對外界指令與言語無反應，約一分鐘突然又恢復動作與意識。在發作時腦波檢查發現有廣泛性每秒三週期的 spike and wave。下列何種抗癲癇藥物是第一線適合用藥？
A. carbamazepine
B. phenobarbital
C. ethosuximide
D. phenytoin

正確答案：C. ethosuximide